有一位 8 個月大之小孩來就診時已經嚴重腹瀉 5 天，理學檢查發現：此病人臉色蒼白，脈搏 180 次/min ，呼吸 45 次/min，血壓 50/30mmHg，微血管回填時間（capillary refill time）為 5 秒。則此時最適當之立即處置為：
A. 抽血作電解質及氣體分析，給予口服飲料
B. 打上點滴，給予 0.9% NaCl 20 mL/kg/1hr
C. 抽血作電解質及氣體分析，給予氧氣
D. 打上點滴，給予 0.33% NaCl in 5% dextrose 80 mL/kg/24hr

正確答案：B. 打上點滴，給予 0.9% NaCl 20 mL/kg/1hr